participation in previous or concurrent HIV vaccine trials

The above is a clinical trial exclusion criterion. Annotated with entity spans:
[Competing_trial: participation in previous or concurrent HIV vaccine trials]